Coagulopathy;

The above is a clinical trial exclusion criterion. Annotated with entity spans:
[Condition: Coagulopathy];